ASA I, II, III.

The above is a clinical trial inclusion criterion. Annotated with entity spans:
[Measurement: ASA] [Value: I, II, III].